Clinical trial inclusion criteria:
Perimenopausal women complaining of abnormal uterine bleeding (menorrhagia, metrorrhagia, polymenorrhoea or polymenorrhagia) without local gynecological cause.
Failure of medical treatment for at least 3 months.

Annotated entities:
- Person: "Perimenopausal"
- Person: "women"
- Condition: "abnormal uterine bleeding"
- Condition: "menorrhagia"
- Condition: "metrorrhagia"
- Condition: "polymenorrhoea"
- Condition: "polymenorrhagia"
- Negation: "without"
- Condition: "local gynecological cause"
- Procedure: "medical treatment"
- Observation: "Failure"
- Multiplier: "for at least 3 months"